Clinical trial inclusion criterion:
Renal function within normal range for age

Annotated entities:
- Measurement: "Renal function"
- Value: "within normal range for age"